梭狀芽孢桿菌屬（Clostridium）病菌生存時不會產生下列何種毒素？
A. 腸毒素（enterotoxins）
B. 神經毒素（neurotoxins）
C. 溶組織毒素（histolytic toxins）
D. 內毒素（endotoxins）

正確答案：D. 內毒素（endotoxins）